In what year did Gregor Mendel die?

The life and personality of Johann Gregor Mendel (1822-1884)